Diabetes mellitus type 1

The above is a clinical trial exclusion criterion. Annotated with entity spans:
[Condition: Diabetes mellitus type 1]